Clinical trial exclusion criterion:
Contraindication for thoracic paravertebral block

Entity relations:
- Has_qualifier("paravertebral block", "thoracic")
- AND("Contraindication", "paravertebral block")